What is BEL(Biological Expression Language) used for?

Biological Expression Language (BEL) is a literature-based method for the statistical estimation of causal relation relationships among entities (e.g. species, populations, populations) and temporal relationships among them.